Desde el punto de vista del metabolismo de xenobióticos, ¿a qué se deben la hepatotoxicidad y la acción cancerígena de las aflatoxinas?
1. Su hidrólisis libera aminas aromáticas.
2. Su metabolismo de la fase II genera un catión nitrenio, que es citotóxico por reaccionar con el ADN.
3. Su metabolismo hepático origina un epóxido, que forma un enlace covalente con la guanina del ADN.
4. Su metabolismo conduce a una especie reactiva a través de un proceso de bioactivación reductora.
5. Facilitan la información de especies reactivas de oxígeno a través de un mecanismo radicalario.

Respuesta correcta: 3. Su metabolismo hepático origina un epóxido, que forma un enlace covalente con la guanina del ADN.